Si el porcentaje de guanina de una molécula de ADN de doble hebra es del 30%, el de adenina es:
1. 10%.
2. 70%.
3. 80%.
4. 20%.
5. 30%.

Respuesta correcta: 4. 20%.